Clinical trial exclusion criterion:
Patients who are legally detained in an official institution.

Annotated entities:
- Observation: "legally detained"
- Visit: "official institution"